Treatment with glucocorticoids

The above is a clinical trial exclusion criterion. Annotated with entity spans:
[Procedure: Treatment] with [Drug: glucocorticoids]